車禍腰部受傷造成右小腿外側感覺喪失，最可能是右側那一條腰部脊神經受損？
A. L2
B. L3
C. L4
D. L5

正確答案：D. L5